Clinical trial exclusion criterion:
gastrointestinal problems or musculoskeletal disorders that would prevent them to follow the test diets or exercise interventions

Annotated entities:
- Condition: "gastrointestinal problems"
- Condition: "musculoskeletal disorders"
- Mood: "prevent"
- Negation: "prevent"
- Procedure: "test diets"
- Procedure: "exercise interventions"